Clinical trial inclusion criterion:
Planned to start docetaxel component of FEC-D or AC-D, or first cycle of; dose-dense AC-T, TC, FEC-D or TAC chemotherapy

Entity relations:
- AND("FEC-D", "docetaxel")
- Has_mood("FEC-D", "Planned to start")
- OR("FEC-D", "AC-D")
- OR("FEC-D", "TC", "FEC-D", "TAC chemotherapy", "dose-dense AC-T")
- OR("docetaxel", "first cycle of")